Clinical trial exclusion criterion:
Exclusion criteria for MRI: having metal in the body and/or having claustrophobia

Annotated entities:
- Condition: "Exclusion criteria for MRI"
- Device: "metal in the body"
- Condition: "claustrophobia"